Morbid obesity (BMI=40kg/m2)

The above is a clinical trial exclusion criterion. Annotated with entity spans:
[Condition: Morbid obesity] ([Measurement: BMI]=[Value: 40kg/m2])